Clinical trial inclusion criterion:
The patients signed the written informed consent

Annotated entities:
- Non-query-able: "The patients signed the written informed consent"